Clinical trial inclusion criterion:
lack of serious hearing and vision impairment and be able to read so that neurobehavioral tests can be performed.

Entity relations:
- Has_negation("hearing impairment", "lack of")
- Has_mood("neurobehavioral tests", "can be performed")
- OR("hearing impairment", "vision impairment")